Clinical trial exclusion criterion:
stroke within the preceding 12 months.

Annotated entities:
- Condition: "stroke"
- Temporal: "within the preceding 12 months"